Clinical trial exclusion criteria:
Active consumption of alcohol and/or drugs
Co-infection with human immunodeficiency virus, hepatitis C virus, or hepatitis D virus
History of autoimmune hepatitis
Psychiatric disease
Evidence of neoplastic diseases of the liver

Annotated entities:
- Condition: "consumption of alcohol"
- Condition: "drugs consumption of"
- Qualifier: "Active"
- Condition: "human immunodeficiency virus"
- Condition: "hepatitis C virus"
- Condition: "hepatitis D virus"
- Condition: "autoimmune hepatitis"
- Temporal: "History"
- Condition: "Psychiatric disease"
- Condition: "neoplastic diseases"
- Mood: "Evidence of"
- Qualifier: "liver"